Clinical trial inclusion criterion:
Evidence of disease progression

Annotated entities:
- Condition: "disease progression"
- Observation: "Evidence"
- Subjective_judgement: "Evidence of disease progression"
- Undefined_semantics: "Evidence of disease progression"